Clinical trial inclusion criterion:
HCV RNA viral load of ≥ 10*5* IU/mL (100,000 IU/mL) at screening

Entity relations:
- Subsumes("≥ 10*5* IU/mL", "100,000 IU/mL")
- Has_value("HCV RNA viral load", "≥ 10*5* IU/mL")
- multi("at screening", "screening")
- Has_temporal("HCV RNA viral load", "at screening")